Clinical trial inclusion criterion:
KPS= 70

Entity relations:
- Has_value("KPS", "= 70")